Clinical trial inclusion criterion:
TBIL(total bilirubin ), ALT(alanine aminotransferase),AST(glutamic-oxalacetic transaminase) > 2.5×ULN(upper limit of normal); if it were caused by liver metastases, TBIL, ALT,AST >5×ULN.

Entity relations:
- Subsumes("AST", "glutamic-oxalacetic transaminase")
- Subsumes("ALT", "alanine aminotransferase")
- Subsumes("TBIL", "total bilirubin")
- Has_value("AST", "> 2.5×ULN")
- Has_value("ALT", "> 2.5×ULN")
- Has_value("TBIL", "> 2.5×ULN")
- Has_value("AST", ">5×ULN")
- Has_value("ALT", ">5×ULN")
- Has_value("TBIL", ">5×ULN")
- OR("TBIL", "ALT", "AST")
- OR("TBIL", "ALT", "AST")
- OR("TBIL", "liver metastases")